Clinical trial exclusion criterion:
Patients with prolonged QT-time or other serious cardiac diseases.

Entity relations:
- Has_qualifier("serious cardiac diseases", "other")
- OR("prolonged QT-time", "serious cardiac diseases")